Clinical trial exclusion criterion:
Acute pulmonary edema.

Annotated entities:
- Condition: "Acute pulmonary edema"